Clinical trial exclusion criterion:
Patients with cardiac problem

Annotated entities:
- Condition: "cardiac problem"